Clinical trial exclusion criterion:
Confirmed platelet count < the LLN of the evaluating laboratory at Screening or documented at <100,000/µL within the past year on a sample without platelet clumping

Annotated entities:
- Measurement: "platelet count"
- Qualifier: "Confirmed"
- Value: "< the LLN of the evaluating laboratory"
- Temporal: "at Screening"
- Value: "<100,000/µL"
- Temporal: "within the past year"
- Qualifier: "sample without platelet clumping"